Clinical trial inclusion criterion:
uterine size <12 weeks.

Entity relations:
- Has_value("uterine size", "<12 weeks")